Failed at least one antiarrhythmic drug (AAD) (Class I or III antiarrhythmic drugs) as evidenced by recurrent symptomatic AF, or intolerable to the AAD

The above is a clinical trial inclusion criterion. Annotated with entity spans:
Failed [Multiplier: at least one] [Drug: antiarrhythmic drug (AAD)] ([Drug: Class I] or [Drug: III antiarrhythmic drugs]) as evidenced by [Condition: recurrent symptomatic AF], or [Condition: intolerable] to the [Condition: AAD]